Clinical trial exclusion criteria:
Patients with liver disease (documented liver function test abnormality)
Patients with renal disease (documented glomerular filtration rate < 60mL/min/1.73m2)
Patients with a baseline (pre-operative) opioid use greater than 30 mg of morphine equivalents/day.
Patients with active alcohol dependence
Patients with active illicit drug dependence
Patients < 18 years of age and >70 years of age
Patients allergic to any medication given in either arm (list medications)
Patients who have a seizure disorder

Annotated entities:
- Condition: "liver disease"
- Measurement: "liver function test"
- Value: "abnormality"
- Condition: "renal disease"
- Measurement: "glomerular filtration rate"
- Value: "< 60mL/min/1.73m2"
- Drug: "opioid"
- Qualifier: "baseline"
- Qualifier: "pre-operative"
- Multiplier: "greater than 30 mg of morphine equivalents/day"
- Condition: "alcohol dependence"
- Condition: "illicit drug dependence"
- Person: "age"
- Value: "< 18 years"
- Person: "age"
- Value: ">70 years"
- Condition: "allergic"
- Drug: "medication"
- Condition: "seizure disorder"